Pregnant or breastfeeding women

The above is a clinical trial exclusion criterion. Annotated with entity spans:
[Condition: Pregnant] or [Observation: breastfeeding] [Person: women]